某研究想估計社區 65 歲以上老人失智症的盛行率，該研究決定以家戶訪視的方法到社區內有 65 歲以上老人的家庭進行失智症的評估，該研究並未受到拒訪的情形，但同時發現所有戶籍登記有案的老人中只有 70%住在家裡。此研究的結果應該要注意：
A. 干擾偏差
B. 選樣偏差
C. 訊息偏差
D. 診斷偏差

正確答案：B. 選樣偏差